下列何者為思覺失調症（schizophrenia）預後不佳的預測因子？
A. 有明顯的誘發因子（precipitating factors）
B. 急性發作
C. 情緒症狀
D. 負性症狀（negative symptoms）

正確答案：D. 負性症狀（negative symptoms）